Clinical trial inclusion criterion:
Habitual dietary sodium intake > 3400mg per day

Entity relations:
- Has_value("dietary sodium intake", "> 3400mg per day")